No Down syndrome

The above is a clinical trial exclusion criterion. Annotated with entity spans:
[Negation: No] [Condition: Down syndrome]